3. Were taking class 1 anti-arrhythmic drugs (e.g., mexiletine, tocainide)

The above is a clinical trial exclusion criterion. Annotated with entity spans:
3. Were taking [Drug: class 1 anti-arrhythmic drugs] (e.g., [Drug: mexiletine], [Drug: tocainide])